Clinical trial exclusion criterion:
Moderate or severe liver affection associated with coagulopathy

Entity relations:
- multi("associated with coagulopathy", "coagulopathy")
- Has_qualifier("liver affection", "associated with coagulopathy")
- Has_qualifier("liver affection", "Moderate")
- OR("Moderate", "severe")